Clinical trial inclusion criterion:
American Society of Anesthesiologists (ASA) 1-3 patients undergoing primary total hip arthroplasty

Annotated entities:
- Measurement: "American Society of Anesthesiologists"
- Measurement: "ASA"
- Value: "1-3"
- Procedure: "primary total hip arthroplasty"